Clinical trial exclusion criterion:
Cervical and vaginal infection.

Annotated entities:
- Condition: "Cervical infection"
- Condition: "vaginal infection"